下列有關 E. coli DNA 複製的敘述，何者錯誤？
A. 需要 RNA 的引子
B. 主要由 DNA polymerase I 來合成
C. 在複製過程中由 Helicase 打開複製的分叉
D. 複製的方向是從 5'→3'，而且可校正錯誤

正確答案：B. 主要由 DNA polymerase I 來合成